Clinical trial inclusion criterion:
Platelet count ≥100 x 109 /L.

Entity relations:
- Has_value("Platelet count", "≥100 x 109 /L")